Clinical trial exclusion criterion:
Are currently abstinent and do not agree to use a double-barrier method (as described above) or refrain from sexual activity during the study period and for 28 days after study drug discontinuation

Annotated entities:
- Condition: "abstinent"
- Temporal: "currently"
- Observation: "double-barrier method"
- Observation: "do not agree"
- Observation: "sexual activity"
- Negation: "refrain"
- Temporal: "during the study period"
- Temporal: "for 28 days after study drug discontinuation"
- Reference_point: "the study period"
- Reference_point: "study drug discontinuation"
- Drug: "study drug"